Clinical trial exclusion criteria:
preterm delivery (<37 weeks of gestation)
birth weight < 2500 g
multiple pregnancy
major illness or congenital anomaly
being <50% breastfed at the time of inclusion
food allergy
anaemia (Hb <105 g/L [10.5 g/dL]) at inclusion, lack of informed consent

Annotated entities:
- Condition: "preterm delivery"
- Value: "<37 weeks"
- Measurement: "gestation"
- Measurement: "birth weight"
- Value: "< 2500 g"
- Condition: "multiple pregnancy"
- Condition: "major illness"
- Condition: "congenital anomaly"
- Multiplier: "<50%"
- Observation: "breastfed"
- Temporal: "at the time of inclusion"
- Condition: "food allergy"
- Condition: "anaemia"
- Measurement: "Hb"
- Value: "<105 g/L"
- Value: "10.5 g/dL"
- Temporal: "at inclusion"
- Informed_consent: "lack of informed consent"